一位 20 歲男性，因情緒、記憶及行為改變，檢查發現大腦顳葉的內下側及額葉之眶回（orbital gyri）有壞死及出血，請問此病灶最可能是由何種病毒引起？
A. 第一型單純疱疹病毒（herpes simplex virus type 1）
B. 第二型單純疱疹病毒（herpes simplex virus type 2）
C. 帶狀疱疹病毒（varicella-zoster virus）
D. 巨細胞病毒（cytomegalovirus）

正確答案：A. 第一型單純疱疹病毒（herpes simplex virus type 1）